At least one week after diagnosis OR a discrepancy of at least one week between crown-rump length and calendar gestational age

The above is a clinical trial inclusion criterion. Annotated with entity spans:
[Temporal: At least one week after diagnosis] OR a [Condition: discrepancy] of [Temporal: at least one week between crown-rump length and calendar gestational age]